The planned procedure can be any of the following: For diagnostic purposes (coronary angiography only, left catheterization, left and right catheterization). For therapeutic purposes: percutaneous coronary intervention (PCI), with or without stent placement.

The above is a clinical trial inclusion criterion. Annotated with entity spans:
The planned [Procedure: procedure] can be any of the following: For [Qualifier: diagnostic] purposes ([Procedure: coronary angiography] [Qualifier: only], [Procedure: left catheterization], [Procedure: left] and [Procedure: right catheterization]). For [Qualifier: therapeutic] purposes: [Procedure: percutaneous coronary intervention] ([Procedure: PCI]), with or without [Procedure: stent placement].